How do the plasma concentrations of amantadine extended release and amantadine immediate release compare?

When it is given at bedtime, it reaches plasma concentration approximately twice the level achieved by amantadine immediate release. PK modeling suggested the recommended daily ADS-5102 dosage (274 mg qhs) resulted in 1.4- to 2.0-fold higher amantadine plasma concentrations during the day versus amantadine IR.